下列有關骨骼肌之敘述，何者錯誤？
A. 收縮力的產生是來自於肌動蛋白（actin）與肌凝蛋白（myosin）的相互作用
B. 鈣離子與calmodulin結合活化myosin light chain kinase而造成收縮
C. H-band位於肌肉的肌節（sarcomere）的中央
D. 在Z-line兩側的I-band主要是由肌動蛋白（actin）所組成的

正確答案：B. 鈣離子與calmodulin結合活化myosin light chain kinase而造成收縮